Clinical trial inclusion criterion:
Genotype 1 and 4 infection.

Annotated entities:
- Measurement: "Genotype"
- Value: "1 and 4"
- Condition: "infection"